What is the active ingredient in the most common hand sanitizer?

While there is a new commercially available hand sanitizer using 0.12% benzalkonium chloride (BZK) as the active ingredient in hand sanitizer, most hand sanitizers are 70-80% ethanol-based or 75% isopropanol